Clinical trial inclusion criterion:
Willing to provide informed consent

Annotated entities:
- Observation: "informed consent"
- Mood: "Willing to provide"